Clinical trial exclusion criterion:
3. Previous CABG

Entity relations:
- Has_temporal("CABG", "Previous")